Renal function, as follows: Creatinine <=1.5 x upper limit of normal (ULN).

The above is a clinical trial inclusion criterion. Annotated with entity spans:
Renal function, as follows: [Measurement: Creatinine] [Value: <=1.5 x upper limit of normal (ULN)].